What is caused by SCUBE2 loss-of-function?

Scube2 plays a key regulatory role in IH-dependent endochondral bone formation. It is a key regulator of IH in coordinating skeletogenesis, and the loss of function of SCUBE2 (-/-) caused defective IHH-mediated Ihh-mediated cell differentiation and proliferation as well as osteoblast differentiation of -/- marrow-marrow.